Clinical trial exclusion criterion:
Co-infection with human immunodeficiency virus, hepatitis C virus, or hepatitis D virus

Entity relations:
- OR("human immunodeficiency virus", "hepatitis C virus", "hepatitis D virus")